鹼化尿液較會促進下列何者再次吸收？
A. amphetamine
B. cromolyn
C. ethacrynic acid
D. methyldopa

正確答案：A. amphetamine